比較三種抗膽鹼激素性藥物（Anti-cholinergic drugs）：Atropine, Scopolamine, Glycopyrrolate 的敘述，下列何者正確？
A. 在抑制口水分泌（Anti-sialagogue effect）的效果中，以 Atropine 最好
B. 在造成譫妄（Delirium）的副作用中，以 Glycopyrrolate 最強
C. 在支氣管擴張（Bronchodilatation）的效果中，以 Scopolamine 最好
D. 在加快心跳（Tachycardia）的效果中，以 Atropine 最好

正確答案：D. 在加快心跳（Tachycardia）的效果中，以 Atropine 最好